Clinical trial exclusion criterion:
Any significant acute or chronic medical illness or problem, including, but not limited to, diabetes, hypertension, cardiac disease, asthma, chronic obstructive lung disease

Entity relations:
- Subsumes("medical illness", "diabetes")
- Has_qualifier("medical illness", "acute")
- OR("diabetes", "asthma", "cardiac disease", "hypertension", "chronic obstructive lung disease")
- OR("acute", "chronic")